List anti-amyloid-beta monoclonal antibodies that have been investigated in clinical trials for treatment of Alzheimer disease.

Bapineuzumab
Solanezumab
Ponezumab
Gantenerumab